Clinical trial inclusion criterion:
Smokes = 1 cigarette per day (cpd)

Annotated entities:
- Observation: "Smokes"
- Multiplier: "= 1 cigarette per day"